English or Spanish speaking*

The above is a clinical trial inclusion criterion. Annotated with entity spans:
[Observation: English] or [Observation: Spanish speaking]*